孩童泌尿道感染最常見的先天性泌尿道疾病是：
A. 輸尿管腎盂接合處阻塞（ureteropelvic junction obstruction）
B. 膀胱輸尿管逆流（vesicoureteral reflux）
C. 巨大輸尿管（megaureter）
D. 輸尿管囊腫（ureterocele）

正確答案：B. 膀胱輸尿管逆流（vesicoureteral reflux）